Clinical trial inclusion criterion:
Subjects are dapsone-naive.

Entity relations:
- Has_negation("dapsone", "naive")